Clinical trial inclusion criteria:
Treated with a stable dose of one of the following for at least 3 months prior to screening: * >=1000 mg/day immediate-release metformin; or metformin >=1000 mg/day and sulfonylurea; or sulfonylurea/metformin combination therapy.
HbA1c between 7.1% and 11.0%, inclusive.
Body Mass Index (BMI) >21 kg/m^2 and <35 kg/m^2.

Annotated entities:
- Qualifier: "stable dose"
- Temporal: "at least 3 months prior to screening"
- Drug: "immediate-release metformin"
- Value: ">=1000 mg/day"
- Drug: "metformin"
- Value: ">=1000 mg/day"
- Drug: "sulfonylurea"
- Drug: "sulfonylurea"
- Drug: "metformin"
- Procedure: "combination therapy"
- Reference_point: "screening"
- Multiplier: "one of the following"
- Measurement: "HbA1c"
- Value: "between 7.1% and 11.0%, inclusive"
- Measurement: "Body Mass Index (BMI)"
- Value: ">21 kg/m^2 and <35 kg/m^2"